Clinical trial exclusion criterion:
Life expectancy < 6 months.

Entity relations:
- Has_value("Life expectancy", "< 6 months")